Clinical trial exclusion criterion:
Prior therapy with VEGFR inhibitors such as sorafenib and sunitinib;

Entity relations:
- AND("VEGFR inhibitors", "sorafenib")
- OR("sorafenib", "sunitinib")